Which protein mediates gene loop formation in the yeast S. cerevisiae?

A transcription-independent role for TFIIB in gene looping.